Clinical trial inclusion criterion:
Platelet count: ≥ 100,000/mm3

Annotated entities:
- Value: "≥ 100,000/mm3"
- Measurement: "Platelet count"